Clinical trial exclusion criterion:
Heart attack, stroke, transient ischemic attack or acute congestive heart failure within 4 months

Entity relations:
- Has_temporal("acute congestive heart failure", "within 4 months")
- OR("Heart attack", "acute congestive heart failure", "stroke", "transient ischemic attack")